Clinical trial inclusion criteria:
Mild male factor infertility or unexplained infertility.

Annotated entities:
- Qualifier: "Mild"
- Condition: "male factor infertility"
- Condition: "unexplained infertility"